Clinical trial exclusion criterion:
Colistin use less than 72 hours

Entity relations:
- Has_temporal("Colistin", "less than 72 hours")